Clinical trial inclusion criterion:
Men or women aged 18-60 years.

Annotated entities:
- Person: "Men"
- Person: "women"
- Person: "aged"
- Value: "18-60 years"
- Condition: "Men or women aged 18-60 years."